Liver enzymes greater than 2 times ULN.

The above is a clinical trial exclusion criterion. Annotated with entity spans:
[Measurement: Liver enzymes] [Value: greater than 2 times ULN].